Clinical trial exclusion criterion:
any other pelvic pathology causing pain

Annotated entities:
- Condition: "pelvic pathology"
- Qualifier: "causing pain"
- Undefined_semantics: "other pelvic pathology causing pain"